Clinical trial inclusion criterion:
ASIA A,B,C, or D

Entity relations:
- Has_value("ASIA", "A,B,C, or D")